RecA是救命反應（SOS response）的主要調控蛋白質，導致受LexA repressor調控的基因表現增加，其作用機制為何？
A. RecA協同DNA聚合酶，將LexA repressor從操縱基因（operator）上移除
B. RecA直接結合到LexA操縱基因（operator）的位置上，使LexA repressor從操縱基因
C. RecA與LexA repressor結合而弱化LexA repressor與操縱基因（operator）結合的親和力
D. RecA與LexA repressor結合，引發LexA repressor的自體裂解（self-cleavage）

正確答案：D. RecA與LexA repressor結合，引發LexA repressor的自體裂解（self-cleavage）